Clinical trial inclusion criterion:
No acute diverticulitis episode in the last 3 months

Entity relations:
- Has_qualifier("diverticulitis", "acute")
- Has_temporal("diverticulitis", "in the last 3 months")